No more than 20 wk of gestation

The above is a clinical trial inclusion criterion. Annotated with entity spans:
[Value: No more than 20 wk] of [Measurement: gestation]